Clinical trial exclusion criterion:
Weight less than 40.0 kg.

Entity relations:
- Has_value("Weight", "less than 40.0 kg")